Clinical trial inclusion criterion:
Patients meeting the Rotterdam PCOS workshop criteria for polycystic ovary syndrome, defined by oligomenorrhea or amenorrhea and at least one of the following two signs: clinical or biochemical evidence of hyperandrogenism or ultrasound finding of polycystic appearing ovaries.

Entity relations:
- Has_value("Rotterdam PCOS workshop criteria for polycystic ovary syndrome", "meeting")
- AND("ultrasound", "polycystic ovaries")
- OR("oligomenorrhea", "amenorrhea")
- OR("hyperandrogenism", "ultrasound")